Acute coronary syndrome (ACS) within 3 months.

The above is a clinical trial exclusion criterion. Annotated with entity spans:
[Condition: Acute coronary syndrome] ([Condition: ACS]) [Temporal: within 3 months].